Clinical trial inclusion criterion:
Estimated life expectancy of more than 12 weeks

Annotated entities:
- Value: "more than 12 weeks"
- Observation: "Estimated life expectancy"